Clinical trial inclusion criterion:
Informed consent

Annotated entities:
- Informed_consent: "Informed consent"